Clinical trial inclusion criteria:
Diagnosis of Heart Failure;
Lower left ventricular ejection fraction 45% (LVEF <45%) assessed by simple and recent echocardiogram;
Functional Class II and III by the New York Heart Association (NYHA)
Clinically stable;
Ex-smokers over five years;
Maximal inspiratory pressure (MIP) <70% of predicted;
Forced expiratory volume/Forced vital capacity (FEV1 / FVC) > 70% of predicted;

Annotated entities:
- Condition: "Heart Failure"
- Measurement: "Lower left ventricular ejection fraction"
- Value: "45%"
- Measurement: "LVEF"
- Value: "<45%"
- Procedure: "echocardiogram"
- Temporal: "recent"
- Measurement: "New York Heart Association (NYHA)"
- Value: "Class II and III"
- Condition: "Clinically stable"
- Condition: "Ex-smokers"
- Temporal: "over five years"
- Measurement: "Maximal inspiratory pressure (MIP)"
- Value: "<70% of predicted"
- Measurement: "Forced expiratory volume/Forced vital capacity (FEV1 / FVC)"
- Value: "> 70% of predicted"